將豬的心臟代替人類衰竭的心臟之移植手術，最大的障礙是：
A. 人類已經產生對別種哺乳動物細胞表面α-Gal 之抗體，因而有超急性排斥（hyperacute rejection）
B. 發炎性血管傷害（inflammatory vascular injury）導致之慢性排斥（chronic rejection）
C. 目前術後之抗排斥藥物使用尚未達成共識
D. 豬的病毒感染問題無法釐清

正確答案：A. 人類已經產生對別種哺乳動物細胞表面α-Gal 之抗體，因而有超急性排斥（hyperacute rejection）